Severe sepsis with multiorgan failure

The above is a clinical trial exclusion criterion. Annotated with entity spans:
[Condition: Severe sepsis] with [Condition: multiorgan failure]